Clinical trial exclusion criterion:
Inpatient status, airway abnormalities, allergy to any study medications, eggs and soy, and mitochondrial disorders.

Annotated entities:
- Observation: "Inpatient status"
- Condition: "airway abnormalities"
- Condition: "allergy"
- Drug: "study medications"
- Drug: "eggs"
- Drug: "soy"
- Condition: "mitochondrial disorders"